Exclusion criteria includes ICUs with an average length of stay of less than 2 days;

The above is a clinical trial exclusion criterion. Annotated with entity spans:
Exclusion criteria includes [Visit: ICUs] with an [Measurement: average length of stay] of [Value: less than 2 days];